Clinical trial exclusion criterion:
Urinary protein > 1 on dipstick

Annotated entities:
- Measurement: "Urinary protein on dipstick"
- Value: "> 1"